Clinical trial exclusion criterion:
Unable to go to clinic visit.

Entity relations:
- Has_context("go to clinic visit", "Unable")